Clinical trial inclusion criterion:
Absent irreversible pulpal alteration;

Entity relations:
- Has_negation("irreversible pulpal alteration", "Absent")